一位 60 歲之肺炎併發急性呼吸窘迫症候群患者治療之第二天，目前使用FiO2：0.8, PEEP：12 cmH2O,  PC（pressure control）：25 cmH2O，其ABG為pH：7.33, PaCO2：50 mmHg, PaO2：55 mmHg, actual bicarbonate：25 mEq/L，下列進一步之處理何者最為正確？
A. 增加PC level為 30 cmH2O，以增加tidal volume，降低PaCO2
B. 增加FiO2至 1.0 以提高PaO2
C. 給予 sodium bicarbonate 以治療酸中毒
D. 給予患者使用鎮靜劑及肌肉鬆弛劑，並考慮使用 prone position

正確答案：D. 給予患者使用鎮靜劑及肌肉鬆弛劑，並考慮使用 prone position